Which transporter is inhibited by Sotagliflozin?

Sotagliflozin, a dual inhibitor of sodium-glucose co-transporters 1 and 2.